Clinical trial exclusion criterion:
Systemic treatment with aminosides in the last 15 days

Entity relations:
- AND("Systemic treatment", "aminosides")
- Has_temporal("Systemic treatment", "in the last 15 days")